Clinical trial exclusion criterion:
Anti-depressants with anti-cholinergic properties

Annotated entities:
- Drug: "Anti-depressants"
- Qualifier: "anti-cholinergic properties"
- Drug: "anti-cholinergic"